¿Qué procedimiento NO forma parte del programa de intervención cognitivo-conductual para el trastorno dismórfico corporal de Rosen y colaboradores?:
1. Psicoeducación.
2. Exposición.
3. Entrenamiento en solución de problemas.
4. Reestructuración cognitiva.
5. Prevención de respuesta.

Respuesta correcta: 3. Entrenamiento en solución de problemas.